Clinical trial exclusion criterion:
allergic to dexmedetomidine, similar active ingredients or excipients

Entity relations:
- AND("dexmedetomidine", "allergic")
- OR("dexmedetomidine", "excipients", "similar active ingredients")